Clinical trial inclusion criterion:
1. Stage 4 colon cancer either s/p metastasectomy or post-initial chemotherapy or maintenance "standard of care", either involving 5-fluorouracil/leucovorin (5-FU/LV) alone or continual bevacizumab alone. Patients in maintenance cohort must have had 2 consecutive CT scans showing stable disease and not be experiencing significant prior treatment-related toxicity above Grade 1.

Annotated entities:
- Condition: "colon cancer"
- Qualifier: "Stage 4"
- Condition: "s/p metastasectomy"
- Procedure: "metastasectomy"
- Condition: "post-initial chemotherapy"
- Procedure: "chemotherapy"
- Drug: "5-fluorouracil/leucovorin (5-FU/LV)"
- Drug: "bevacizumab"
- Procedure: "maintenance "standard of care""
- Undefined_semantics: "maintenance "standard of care""
- Multiplier: "2"
- Procedure: "CT scans"
- Qualifier: "stable"
- Condition: "disease"
- Undefined_semantics: "disease"
- Condition: "treatment-related toxicity"
- Temporal: "prior"
- Negation: "not"